下列那一種維生素的化學結構含有鈷離子（cobalt ion）？
A. vitamin K
B. vitamin E
C. vitamin B6
D. vitamin B12

正確答案：D. vitamin B12